因長期帶耳機聽高音量的重低音搖滾樂，造成聽力受損。其最有可能受損的耳蝸神經位於何處？
A. 靠近 oval window 的 basilar membrane
B. 靠近 oval window 的 tectorial membrane
C. 靠近耳蝸尾端處的 basilar membrane
D. 靠近耳蝸尾端處的 tectorial membrane

正確答案：C. 靠近耳蝸尾端處的 basilar membrane